Clinical trial exclusion criterion:
Currently or has recently received radiotherapy or chemotherapy, adrenocorticotropic hormone (ACTH), corticosteroids, or immunosuppressive drugs.

Entity relations:
- Subsumes("adrenocorticotropic hormone", "ACTH")
- Has_temporal("radiotherapy", "recently")
- OR("radiotherapy", "chemotherapy", "adrenocorticotropic hormone", "corticosteroids", "immunosuppressive drugs")